What is CIBERSORT used for?

CIBERSORT is a versatile computational method for characterizing cell composition of complex tissues from their gene expression profiles.